Clinical trial inclusion criterion:
Not pregnant for female subjects.

Entity relations:
- AND("female", "pregnant")
- Has_negation("pregnant", "Not")